以下何者不是 ARDS（Acute respiratory distress syndrome）之特色？
A. 胸部 X 光片顯示兩側肺部浸潤
B. PaO2/FiO2＜200
C. PAWP（Pulmonary artery wedge pressure）＞18 mmHg
D. 急性發作（Acute onset）

正確答案：C. PAWP（Pulmonary artery wedge pressure）＞18 mmHg